Clinical trial inclusion criterion:
Primary knee osteoarthritis diagnosed using the American College of Rheumatology criteria (46)

Entity relations:
- Has_qualifier("Primary knee osteoarthritis", "American College of Rheumatology criteria")